Kallmann syndrome 會引起腦下垂體功能不足，導致不孕，並伴隨有那種感官障礙？
A. 視覺
B. 嗅覺
C. 聽覺
D. 味覺

正確答案：B. 嗅覺